一般而言，若某數據之分布為右偏（skew to right）時，則下列敘述何者正確？
A. 眾數＞中位數＞平均數
B. 眾數＞平均數＞中位數
C. 平均數＞眾數＞中位數
D. 平均數＞中位數＞眾數

正確答案：D. 平均數＞中位數＞眾數